P. L. es un paciente que presenta infecciones urinarias frecuentes. Al explicarle las posibles causas de las mismas le comentará que un factor de riesgo es:
1. La presencia de cálculos urinarios.
2. La ingesta de sustancias que acidifican la orina.
3. El aumento de leucocitos en orina.
4. La saturación de orina por sales cálcicas.
5. La emisión de orina cada 2 o 3 horas.

Respuesta correcta: 1. La presencia de cálculos urinarios.